Pregnancy, breast-feeding

The above is a clinical trial exclusion criterion. Annotated with entity spans:
[Pregnancy_considerations: Pregnancy, breast-feeding]